Name one CCR4 targeted drug.

Mogamulizumab is an anti-CCR4 monoclonal antibody.